Other tumor type than adenocarcinoma

The above is a clinical trial exclusion criterion. Annotated with entity spans:
[Negation: Other] [Condition: tumor] type than [Condition: adenocarcinoma]